Currently taking medications containing alcohol, metronidazole, isoniazid, paraldehyde, phenytoin, warfarin, or theophylline.

The above is a clinical trial exclusion criterion. Annotated with entity spans:
[Temporal: Currently] taking medications containing [Drug: alcohol], [Drug: metronidazole], [Drug: isoniazid], [Drug: paraldehyde], [Drug: phenytoin], [Drug: warfarin], or [Drug: theophylline].